Cytochrome p450 CYP3A is induced by rifampicin  and compounds used to treat what virus?

Etravirine is an effective and well-tolerated recently approved non-nucleoside reverse transcriptase inhibitor (NNRTI) for HIV type-1-infected patients with previous antiretroviral treatment experience.  Etravirine is a weak inducer of cytochrome P450 (CYP)3A